patients were 18 years old or more,

The above is a clinical trial inclusion criterion. Annotated with entity spans:
patients were [Value: 18 years old or more],